Clinical trial inclusion criterion:
Subjects with over moderate atopic dermatitis (SCORAD score > 20)

Annotated entities:
- Condition: "atopic dermatitis"
- Measurement: "SCORAD score"
- Value: "> 20"
- Qualifier: "over moderate"